Clinical trial inclusion criteria:
Biopsy-proven LN Class III/IV±V (ISN/RPS 2003), with biopsy performed within 12 weeks of randomization.
Positive anti-dsDNA.
Active LN with proteinuria (urine protein/creatinine ratio >1.0 or 24-hr urine protein >1.0 g at baseline), with or without hematuria.
Both 'incident' (i.e. new) patients and 'flare' patients can be included.

Annotated entities:
- Condition: "LN"
- Qualifier: "Class III/IV±V"
- Procedure: "biopsy"
- Temporal: "within 12 weeks"
- Measurement: "anti-dsDNA"
- Value: "Positive"
- Condition: "LN"
- Condition: "proteinuria"
- Measurement: "urine protein/creatinine ratio"
- Value: ">1.0"
- Measurement: "24-hr urine protein"
- Value: ">1.0 g"
- Qualifier: "Active"
- Condition: "hematuria"
- Non-query-able: "Both 'incident' (i.e. new) patients and 'flare' patients can be included"